Total bilirubin < 1.5 x upper limit of normal

The above is a clinical trial inclusion criterion. Annotated with entity spans:
[Measurement: Total bilirubin] [Value: < 1.5 x upper limit of normal]